M1 or M2 marrow on day 15

The above is a clinical trial inclusion criterion. Annotated with entity spans:
[Line: M1 or M2 marrow on day 15]